Chronic liver disease (Cirrhosis, malignancy and patients with more than twice the upper limit of liver function tests)

The above is a clinical trial exclusion criterion. Annotated with entity spans:
[Condition: Chronic liver disease] ([Condition: Cirrhosis], [Condition: malignancy] and patients with [Value: more than twice the upper limit] of [Measurement: liver function tests])